Clinical trial inclusion criterion:
Unresectable, histologically confirmed hepatocellular carcinoma with evident disease limited to liver.

Annotated entities:
- Qualifier: "Unresectable"
- Condition: "hepatocellular carcinoma"
- Measurement: "histologically"
- Value: "confirmed"
- Qualifier: "disease limited to liver"